Clinical trial exclusion criterion:
STEMI

Annotated entities:
- Condition: "STEMI"